Clinical trial exclusion criterion:
Known allergy/sensitivity or any hypersensitivity to components of study drugs (ART) or their formulations

Entity relations:
- Subsumes("components of study drugs", "ART")
- AND("hypersensitivity", "components of study drugs")
- OR("components of study drugs", "or their formulations")
- OR("allergy", "hypersensitivity", "sensitivity")